林先生是一位 60 歲的農夫，因左足慢性潰瘍於 12 小時前接受植皮手術，術後經恢復室送返病房接受照顧，左側下肢以短腿石膏固定（short leg splint）。林先生抱怨左足疼痛、行走不便，要求移除石膏，下列處置何者最適當？
A. 拆除所有石膏及包紮，直接檢視植皮與傷口，不需再使用石膏固定
B. 小心拆開石膏包紮，檢視骨隆起處有否壓迫痕跡，增加棉墊間隔後，再以適度的鬆緊包回原石膏
C. 給予配西汀（pethidine, meperidine, demerol）50 mg，肌肉注射，勸告林先生不可移除石膏
D. 照會麻醉科安裝病患自控式止痛裝置（patient-controlled analgesia, PCA），勸告林先生不可移除石膏

正確答案：B. 小心拆開石膏包紮，檢視骨隆起處有否壓迫痕跡，增加棉墊間隔後，再以適度的鬆緊包回原石膏